Clinical trial inclusion criterion:
Aspartate aminotransferase (AST)/Alanine aminotransferase (ALT) <10x upper limit of normal

Entity relations:
- Has_value("Alanine aminotransferase (ALT)", "<10x upper limit of normal")
- Has_value("Aspartate aminotransferase (AST)", "<10x upper limit of normal")